Clinical trial inclusion criterion:
Origin Caucasian

Annotated entities:
- Condition: "Caucasian"